Clinical trial exclusion criterion:
Emergency operation

Annotated entities:
- Procedure: "operation"
- Qualifier: "Emergency"